Clinical trial exclusion criterion:
Has had major surgery to liver or other site within 4 weeks prior to the first dose of study medication

Annotated entities:
- Procedure: "major surgery"
- Qualifier: "liver"
- Qualifier: "other site"
- Temporal: "within 4 weeks prior"
- Reference_point: "first dose of study medication"